Failure of prior therapy (during or after treatment) in patients who have received at least two prior chemotherapy regimens;

The above is a clinical trial inclusion criterion. Annotated with entity spans:
[Qualifier: Failure] of prior therapy (during or after treatment) in patients who have received [Multiplier: at least two] prior [Procedure: chemotherapy] regimens;